Clinical trial inclusion criterion:
C-peptide levels = 1.5 ng/mL

Annotated entities:
- Measurement: "C-peptide levels"
- Value: "= 1.5 ng/mL"